Thunderclap onset of the headache

The above is a clinical trial exclusion criterion. Annotated with entity spans:
[Condition: Thunderclap onset] of the [Condition: headache]